Dentro del estudio orientado a la especificación de los ingredientes activos de un tratamiento psicológico, la estrategia que consiste en ir alterando no los ingredientes del tratamiento, sino la cuantía de los mismos (p.ej. la intensidad de un ingrediente) hasta conseguir la máxima eficacia se conoce como:
1. Tratamiento paramétrico.
2. Construir el tratamiento.
3. Tratamiento placebo.
4. Desmantela el tratamiento.

Respuesta correcta: 1. Tratamiento paramétrico.